Clinical trial exclusion criterion:
Cancer with current treatment

Entity relations:
- Has_temporal("treatment", "current")
- AND("Cancer", "treatment")